Clinical trial exclusion criterion:
Received electroconvulsive therapy in the past 6 months or during the current depressive episode.

Entity relations:
- Has_temporal("depressive episode", "current")
- Has_temporal("electroconvulsive therapy", "in the past 6 months")
- Has_index("during the current depressive episode", "the current depressive episode")
- AND("electroconvulsive therapy", "depressive episode")
- OR("in the past 6 months", "during the current depressive episode")